Clinical trial exclusion criterion:
Any disease or condition that interferes with completion of initial or follow-up assessments

Entity relations:
- Has_qualifier("disease", "interferes with completion of initial or follow-up assessments")
- OR("disease", "condition")